Clinical trial exclusion criteria:
pregnant or nursing woman
serious concomitant illness and malignant tumor of any kind
history of hypersensitivity to test drugs
serious bleeding during the course of the ulcer
previous gastric surgery
receiving bismuth salts, PPIs, or antibiotics in the previous month.

Annotated entities:
- Condition: "pregnant"
- Condition: "nursing"
- Person: "woman"
- Qualifier: "serious"
- Temporal: "concomitant"
- Condition: "illness"
- Condition: "malignant tumor"
- Qualifier: "any kind"
- Temporal: "history"
- Condition: "hypersensitivity"
- Drug: "test drugs"
- Qualifier: "serious"
- Condition: "bleeding"
- Temporal: "during the course of the ulcer"
- Reference_point: "the ulcer"
- Condition: "ulcer"
- Temporal: "previous"
- Procedure: "gastric surgery"
- Drug: "bismuth salts"
- Drug: "PPIs"
- Drug: "antibiotics"
- Temporal: "in the previous month"